Clinical trial exclusion criteria:
Have history of female sterilization procedure
Desire for conception in the next 12 months
Not sexually active with a male partner

Annotated entities:
- Procedure: "female sterilization procedure"
- Mood: "Desire"
- Observation: "conception"
- Temporal: "in the next 12 months"
- Negation: "Not"
- Observation: "sexually active"
- Qualifier: "male partner"